Clinical trial inclusion criterion:
Foot ulcer at the malleoli area between 0,25 cm² and 5,0 cm²

Entity relations:
- Has_qualifier("Foot ulcer", "malleoli area")
- Has_value("Foot ulcer", "between 0,25 cm² and 5,0 cm²")